Platelets = 50,000/mm3

The above is a clinical trial exclusion criterion. Annotated with entity spans:
[Measurement: Platelets] [Value: = 50,000/mm3]